Clinical trial inclusion criterion:
Diagnosis of MS according to the McDonald criteria 2010 and cranial MRI scan demonstrating white matter lesions attributable to MS within 10 years before Screening

Entity relations:
- AND("McDonald criteria 2010", "MS")
- Has_temporal("MS", "within 10 years before Screening")
- AND("cranial MRI scan", "MS")